60歲的癲癇病人，服用下列某一種抗癲癇藥物，在剛開始服用的前兩週其效果不錯，但服用四週後開始出現偶發性癲癇的發作，在進行血中藥物濃度檢測後，發現其藥物濃度隨服藥期間的延長而逐漸的遞減，可能服用下列那一種抗癲癇藥物？
A. gabapentin
B. ethosuximide
C. carbamazepine
D. primidone

正確答案：C. carbamazepine